Clinical trial exclusion criterion:
Attending provider excludes patient

Annotated entities:
- Non-representable: "Attending provider excludes patient"